Score ≤ 10 on the Short Physical Performance Battery OR Walking speed < 1.2 m/sec during 400 m usual-paced test

The above is a clinical trial inclusion criterion. Annotated with entity spans:
[Value: Score ≤ 10] on the [Measurement: Short Physical Performance Battery] OR [Measurement: Walking speed] [Value: < 1.2 m/sec] during [Procedure: 400 m usual-paced test]